Clinical trial exclusion criterion:
4. Noise-induced hearing loss or tinnitus.

Annotated entities:
- Parsing_Error: "4."
- Condition: "Noise-induced hearing loss"
- Condition: "tinnitus"